Clinical trial inclusion criteria:
Age 18-80 years old;
IFG: 5.6mmol/L (100mg/dl)=FPG<7.0mmol/L (126mg/dl), or IGT: 7.8mmol/L (140mg/dl)=OGTT 2-h PG<11.1mmol/L (200mg/dl), or HbA1C 5.7-6.4% (39-47mmol/mol);
2.6mmol/L (100mg/dl)=LDL-C=5.2mmol/L (200mg/dl), and TG<5.7mmol/L (500mg/dl);
130mmHg=SBP<180mmHg, or 80mmHg=DBP<110mmHg or ongoing anti-hypertensive therapy;
Patients volunteered for the study and signed informed consent.

Annotated entities:
- Person: "Age"
- Value: "18-80 years old"
- Condition: "IFG"
- Value: "5.6mmol/L"
- Measurement: "FPG"
- Value: "100mg/dl"
- Value: "<7.0mmol/L"
- Value: "126mg/dl"
- Condition: "IGT"
- Value: "7.8mmol/L"
- Value: "140mg/dl"
- Measurement: "OGTT 2-h PG"
- Measurement: "HbA1C"
- Value: "5.7-6.4%"
- Value: "39-47mmol/mol"
- Value: "<11.1mmol/L"
- Value: "200mg/dl"
- Value: "2.6mmol/L"
- Value: "100mg/dl"
- Measurement: "LDL-C"
- Value: "5.2mmol/L"
- Value: "200mg/dl"
- Measurement: "TG"
- Value: "<5.7mmol/L"
- Value: "500mg/dl"
- Value: "130mmHg"
- Measurement: "SBP"
- Value: "<180mmHg"
- Value: "80mmHg="
- Measurement: "DBP"
- Value: "<110mmHg"
- Temporal: "ongoing"
- Procedure: "anti-hypertensive therapy"
- Informed_consent: "Patients volunteered for the study and signed informed consent."